poor tolerance of or technical difficulties with performing transesophageal echocardiography

The above is a clinical trial exclusion criterion. Annotated with entity spans:
[Condition: poor tolerance] of or [Observation: technical difficulties] with performing [Procedure: transesophageal echocardiography]